關於慢性腎臟病（chronic kidney disease）的敘述，下列何者最不正確？
A. 根據目前國際所認知的分期，一位 70 歲 72 公斤的男性病人，他的血清肌酸酐為 2.5 mg/dL，應該是第四期
B. 使用 captopril 可以延緩慢性腎病衰竭的速度，主要是可以增加腎絲球內壓力，提高腎絲球過濾速率
C. 目前最被研究和腎臟衰竭相關的基因是 angiotensin-converting enzyme。具有 deletion（D）的同質接合者（DD），其腎功能比較會進展至衰竭
D. 有蛋白尿的慢性腎臟病人，血壓的控制目標是在 125/75 mmHg

正確答案：B. 使用 captopril 可以延緩慢性腎病衰竭的速度，主要是可以增加腎絲球內壓力，提高腎絲球過濾速率